Clinical trial inclusion criterion:
Stage I (140-159/90-99 mmHg) untreated subjects with essential hypertension

Entity relations:
- Has_qualifier("essential hypertension", "untreated")
- Has_qualifier("essential hypertension", "Stage I")